¿A qué rango de edad se administra el Inventario de desarrollo Batelle?:
1. 0-2 años.
2. 0-4 años.
3. 0-6 años.
4. 0-8 años.
5. 0-10 años.

Respuesta correcta: 4. 0-8 años.